下列關於真核細胞蛋白質合成之敘述，何者正確？
A. 所有蛋白質的 N 端起始胺基酸必為甲硫胺酸（methionine）
B. 所有蛋白質的 N 端起始胺基酸必為色胺酸（tryptophan）
C. 所有蛋白質的 N 端起始胺基酸必為半胱胺酸（cysteine）
D. 所有蛋白質的 N 端起始胺基酸必為組胺酸（histidine）

正確答案：A. 所有蛋白質的 N 端起始胺基酸必為甲硫胺酸（methionine）